Clinical trial inclusion criterion:
A diagnosis of VTE in outpatient clinic or as discharge diagnosis after hospitalization.

Entity relations:
- Has_temporal("discharge diagnosis", "after hospitalization")
- multi("hospitalization", "hospitalization")
- Has_index("after hospitalization", "hospitalization")
- AND("VTE", "outpatient clinic")
- OR("outpatient clinic", "discharge diagnosis")